活化下列那一蛋白質可加速心肌的放鬆，使心室充血期時間比例增加？
A. 細胞膜上L-型鈣離子通道（L-type Ca2+ channels）
B. 肌漿網上雷恩諾鹼受體（ryanodine receptors）
C. 肌旋轉素（troponin）
D. 肌漿網上鈣離子幫浦（Ca2+ ATPase）

正確答案：D. 肌漿網上鈣離子幫浦（Ca2+ ATPase）